Clinical trial exclusion criterion:
Hypersensitivity to morphine, naltrexone.

Annotated entities:
- Condition: "Hypersensitivity"
- Drug: "morphine"
- Drug: "naltrexone"